Tenofovir disoproxil fumarate (TDF) to tenofovir alafenamide fumarate (TAF)/TAF-containing fixed-dose combination regimens

The above is a clinical trial inclusion criterion. Annotated with entity spans:
[Drug: Tenofovir disoproxil fumarate (TDF)] to [Drug: tenofovir alafenamide fumarate (TAF)]/[Procedure: TAF-containing fixed-dose combination regimens]